Patients on regular hemodialysis 3sessions/wk.

The above is a clinical trial inclusion criterion. Annotated with entity spans:
Patients on [Procedure: regular hemodialysis] [Multiplier: 3sessions/wk].